List all the available databases of super enhancers

dbSUPER and SEA are the available databases of super enhancers.